Clinical trial exclusion criterion:
Known hypersensitivity to any of the drugs given

Entity relations:
- AND("hypersensitivity", "drugs")